下列有關持續使用促性腺激素釋放激素（gonadotropin releasing hormone; GnRH）模擬藥物時會發生的副作用描述，何者錯誤？
A. 婦女長期使用時容易發生卵巢囊腫（ovarian cysts）的現象，但停藥後即可以改善
B. 長期皮下注射給藥時容易發生全身過敏性皮膚炎（generalized hypersensitivity
C. 婦女長期使用時容易降低骨質密度及發生骨質疏鬆（osteoporosis）的情形
D. 長期使用時容易發生中樞性性早熟（central precocious puberty）的情形

正確答案：D. 長期使用時容易發生中樞性性早熟（central precocious puberty）的情形